Abnormal renal or liver function

The above is a clinical trial exclusion criterion. Annotated with entity spans:
[Condition: Abnormal renal] or liver function